Clinical trial exclusion criterion:
Contraindications to therapy with the study drug or hypersensitivity to the study drug (active ingredient or excipients of the formulation).

Annotated entities:
- Post-eligibility: "Contraindications to therapy with the study drug or hypersensitivity to the study drug (active ingredient or excipients of the formulation)."